頸闊肌（platysma muscle）與下列何肌肉受相同神經支配？
A. 莖突舌骨肌（stylohyoid muscle）
B. 咬肌（masseter muscle）
C. 二腹肌前腹（anterior belly of digastric muscle）
D. 肩胛舌骨肌（omohyoid muscle）

正確答案：A. 莖突舌骨肌（stylohyoid muscle）